Clinical trial exclusion criterion:
Known or suspected haemoglobinopathy/thalassaemia

Annotated entities:
- Condition: "haemoglobinopathy"
- Condition: "thalassaemia"
- Mood: "suspected"
- Mood: "Known"